Clinical trial exclusion criterion:
Major neurological or medical illnesses that affect weight gain (e.g., unstable thyroid disease) or require a systemic medication that might impact weight or glucose regulation (e.g., diabetes mellitus [insulin], chronic renal failure [steroids]);

Annotated entities:
- Condition: "thyroid disease"
- Qualifier: "unstable"
- Condition: "diabetes mellitus"
- Drug: "insulin"
- Condition: "chronic renal failure"
- Drug: "steroids"